Clinical trial inclusion criteria:
Age 65 - 79
History of coronary artery disease (MI/heart attack, stroke, heart failure, or peripheral artery disease)
Cancer, with no active treatment in the last year
MCI (MoCA >18<26 -inclusive of 1 point if <12 years of education Group 2
Decline physical function (walking speed < 1 m/s) Group 3 (Either or both)
Abdominal obesity (>88cm women, >102cm men) AND hypertension (treated or resting blood pressure >140/90
Abdominal obesity (>88cm women, >102cm men) AND hyperlipidemia (treated or fasting total cholesterol >240 English literacy Willing to provide informed consent

Annotated entities:
- Person: "Age"
- Value: "65 - 79"
- Condition: "coronary artery disease"
- Temporal: "History"
- Condition: "heart attack"
- Condition: "MI"
- Condition: "stroke"
- Condition: "heart failure"
- Condition: "peripheral artery disease"
- Condition: "Cancer"
- Negation: "no"
- Procedure: "active treatment"
- Temporal: "in the last year"
- Condition: "MCI"
- Measurement: "MoCA"
- Value: ">18<26"
- Non-representable: "-inclusive of 1 point if <12 years of education Group 2"
- Condition: "Decline physical function"
- Measurement: "walking speed"
- Value: "< 1 m/s"
- Non-representable: "Group 3 (Either or both)"
- Condition: "Abdominal obesity"
- Value: ">88cm"
- Value: ">102cm"
- Measurement: "Abdominal"
- Person: "women"
- Person: "men"
- Condition: "hypertension"
- Procedure: "treated"
- Measurement: "resting blood pressure"
- Value: ">140/90"
- Condition: "Abdominal obesity"
- Value: ">88cm"
- Value: ">102cm"
- Person: "women"
- Person: "men"
- Condition: "hyperlipidemia"
- Procedure: "treated"
- Measurement: "fasting total cholesterol"
- Value: ">240"
- Observation: "English literacy"
- Observation: "provide informed consent"
- Mood: "Willing to"